All patients with esophageal cancer who are deemed candidates for minimally invasive robot assisted Ivor Lewis esophagogastrectomy.

The above is a clinical trial inclusion criterion. Annotated with entity spans:
All patients with [Condition: esophageal cancer] who are deemed [Observation: candidates] for [Qualifier: minimally invasive] [Qualifier: robot assisted] [Qualifier: Ivor Lewis] [Procedure: esophagogastrectomy].